Clinical trial exclusion criterion:
Clinical visual evidence of candidiasis at Visit 1 (Screening).

Annotated entities:
- Condition: "visual evidence"
- Condition: "candidiasis"
- Temporal: "at Visit 1 (Screening)"
- Reference_point: "Visit 1 (Screening)"